咖啡因（caffeine）的戒斷症狀，下列何者正確？
A. 戒斷症狀常於咖啡停止一星期後發生
B. 最常見症狀包括頭痛、倦怠
C. 常見症狀包括幻聽、妄想
D. 戒斷症狀的嚴重度與咖啡因的使用量無關

正確答案：B. 最常見症狀包括頭痛、倦怠